Clinical trial exclusion criterion:
Second or third degree heart block without a pacemaker

Annotated entities:
- Condition: "third degree heart block"
- Condition: "Second degree heart block"
- Device: "pacemaker"
- Negation: "without"